兒童期須施行肝臟移植最常見的適應症（indication）為：
A. 膽道閉鎖症
B. 代謝性肝臟疾病
C. 猛爆型肝炎
D. 家族性膽汁滯留症

正確答案：A. 膽道閉鎖症